Current peripheral neuropathy of Grade ≥ 3.

The above is a clinical trial exclusion criterion. Annotated with entity spans:
[Temporal: Current] [Condition: peripheral neuropathy] of [Qualifier: Grade ≥ 3].